Clinical trial inclusion criteria:
Male or female on stable dose of IgPro20 (Hizentra) therapy.
Women of childbearing potential must be using and agree to continue using medically approved contraception (which must be discussed with the study doctor) and must have a negative pregnancy test at screening.
Subjects with PID, eg, with a diagnosis of common variable immunodeficiency or X-linked agammaglobulinemia, as defined by the Pan American Group for Immune Deficiency and the European Society of Immune Deficiencies.
With infusion parameters as specified below:
Experience with pump-assisted infusions of IgPro20 at the tolerated flow rate of 25 mL/h per injection site for at least 1 month prior to Day 1.
Total weekly IgPro20 dose of = 50 mL (= 10 g).
Experience with pump-assisted infusions of IgPro20 at tolerated volumes of 25 mL/injection site for at least 1 month prior to Day 1.
Experience with frequent (2-7 times per week) infusions of IgPro20 at the tolerated flow rate of approximately 0.5 mL/min (equivalent of 25-30 mL/h) per injection site for at least 1 month prior to Day 1. The dose (volume) per injection site should not exceed 25 mL.

Annotated entities:
- Person: "Male"
- Person: "female"
- Drug: "IgPro20"
- Drug: "Hizentra"
- Qualifier: "stable dose"
- Pregnancy_considerations: "Women of childbearing potential must be using and agree to continue using medically approved contraception (which must be discussed with the study doctor) and must have a negative pregnancy test at screening"
- Condition: "PID"
- Condition: "common variable immunodeficiency"
- Condition: "X-linked agammaglobulinemia"
- Measurement: "Pan American Group for Immune Deficiency"
- Measurement: "European Society of Immune Deficiencies"
- Non-query-able: "and"
- Qualifier: "pump-assisted infusions"
- Drug: "IgPro20"
- Multiplier: "flow rate of 25 mL/h per injection site"
- Qualifier: "tolerated"
- Temporal: "for at least 1 month prior to Day 1"
- Reference_point: "Day 1"
- Qualifier: "weekly"
- Drug: "IgPro20"
- Multiplier: "= 50 mL"
- Multiplier: "= 10 g"
- Qualifier: "pump-assisted infusions"
- Drug: "IgPro20"
- Multiplier: "volumes of 25 mL/injection site"
- Qualifier: "tolerated"
- Temporal: "for at least 1 month prior to Day 1"
- Reference_point: "Day 1"
- Qualifier: "frequent"
- Drug: "IgPro20"
- Multiplier: "per injection site flow rate of approximately 0.5 mL/min"
- Multiplier: "25-30 mL/h"
- Temporal: "for at least 1 month prior to Day 1"
- Reference_point: "Day 1"
- Multiplier: "2-7 times per week"
- Negation: "not"
- Multiplier: "exceed 25 mL."